(2)A diagnosis or previous diagnosis of essential hypertension, including anyone currently taking antihypertensive drugs; or for those who have not taken antihypertensive drugs within the last 2 weeks, two consecutive examinations were conducted at least one day apart, and both sitting blood pressure (mean value of 3 measurements) met the following criteria: diastolic blood pressure (DBP) =90 mmHg or systolic blood pressure (SBP) =140 mmHg (the second blood pressure was measured at V1);

The above is a clinical trial inclusion criterion. Annotated with entity spans:
(2)A [Mood: diagnosis] or [Temporal: previous] diagnosis of [Condition: essential hypertension], including anyone [Temporal: currently] taking [Drug: antihypertensive drugs]; or for those who have [Negation: not] taken [Drug: antihypertensive drugs] [Temporal: within the last 2 weeks], [Multiplier: two consecutive] examinations were conducted at least one day apart, and both [Procedure: sitting blood pressure] (mean value of 3 measurements) met the following criteria: [Measurement: diastolic blood pressure (DBP)] [Value: =90 mmHg] or [Measurement: systolic blood pressure (SBP)] [Value: =140 mmHg] [Non-representable: (the second blood pressure was measured at V1)];